Clinical trial exclusion criterion:
no positive pregnancy test or breast feeding at screening

Annotated entities:
- Procedure: "pregnancy test"
- Value: "positive"
- Observation: "breast feeding"
- Temporal: "at screening"